Clinical trial inclusion criterion:
No prior chemotherapy but prior adjuvant chemotherapy finished at least 6 months before enrollment was allowed. (but, prior adjuvant chemotherapy with capecitabine or S-1 or camptothecin analogues was excluded)

Annotated entities:
- Procedure: "chemotherapy"
- Temporal: "prior"
- Negation: "No"
- Procedure: "adjuvant chemotherapy"
- Temporal: "prior"
- Temporal: "at least 6 months before enrollment"
- Procedure: "adjuvant chemotherapy"
- Temporal: "prior"
- Drug: "capecitabine"
- Drug: "S-1"
- Drug: "camptothecin analogues"
- Negation: "excluded"
- Reference_point: "enrollment"
- Negation: "was allowed"